How rare are CTCs (circulating tumour cells) in the plasma of patients?

extremely low